El virus del papiloma humano se ha relacionado con la neoplasia cervical intraepitelial y el cáncer de cuello uterino. ¿Qué genotipo es el más oncogénico?
1. Genotipo 16.
2. Genotipo 11.
3. Genotipo 6.
4. Genotipo 23.
5. Genotipo 55.

Respuesta correcta: 1. Genotipo 16.